Aspirin 之 pKa 為 3.5，則吸收至胃黏膜細胞內（pH 7.5）的離子型態藥物約為非離子型態的多少倍？
A. 10 倍
B. 100 倍
C. 1,000 倍
D. 10,000 倍

正確答案：D. 10,000 倍